Clinical trial inclusion criterion:
Absence of cervical restorations extending to the CEJ

Entity relations:
- Has_negation("cervical restorations extending to the CEJ", "Absence")